Clinical trial inclusion criterion:
Systemic sclerosis meeting the EULAR criteria.

Entity relations:
- Has_value("EULAR criteria", "meeting")
- AND("Systemic sclerosis", "EULAR criteria")